Rectal prolapse

The above is a clinical trial exclusion criterion. Annotated with entity spans:
[Condition: Rectal prolapse]